Clinical trial inclusion criterion:
Current substance abuse (e.g., alcohol, cocaine, heroin, etc.)

Annotated entities:
- Condition: "substance abuse"